關於面神經（facial nerve）之敘述，下列何者錯誤？
A. 面神經核（facial nucleus）位於橋腦（pons）
B. 右側面神經核（facial nucleus）損傷，可導致右側顏面表情肌全麻痺（right facial palsy）
C. 面神經核（facial nucleus）之神經元，屬於下運動神經元（lower motor neuron）
D. 面神經（facial nerve）可傳遞咀嚼肌之本體感覺（proprioception）

正確答案：D. 面神經（facial nerve）可傳遞咀嚼肌之本體感覺（proprioception）